Clinical trial exclusion criterion:
metabolic disorder

Annotated entities:
- Condition: "metabolic disorder"